下列有關中央脊髓症候群（central cord syndrome）的描述，何者錯誤？
A. 無力的症狀主要出現在上肢遠端的肌肉群
B. 異常主要出現在肩膀（shoulder）
C. X 光的影像上常無法看見有明顯的脊椎骨折
D. 常出現在脖子過度屈曲（hyperflexion）或過度伸張（hyperextension）的病人

正確答案：B. 異常主要出現在肩膀（shoulder）